4. Subjects in Phase 2 must have disease amenable to biopsy and must be willing to undergo pre- and post-treatment tumor biopsies. Optional for Phase 1.

The above is a clinical trial inclusion criterion. Annotated with entity spans:
[Parsing_Error: 4.] Subjects in Phase 2 must have [Condition: disease amenable to biopsy] and must be [Non-query-able: willing to undergo pre- and post-treatment tumor biopsies]. [Parsing_Error: Optional for Phase 1.]